78 歲的王先生，最近三年來逐漸出現胸口悶痛，偶有昏厥的情況，今年甚至會有氣促、稍微活動即有呼吸困難的現象。身體診查發現王先生之脈搏呈現持續的緩慢、細小之細遲脈，而心音聽診上可發現於心尖處聽到 S3、S4 心音，於右側第二肋間可聽到低頻、粗糙、grade III/VI 之收縮中期心雜音，亦可於左胸骨下緣至心尖處聽到較弱（grade II/VI）之收縮期雜音。請問王先生最可能罹患何種疾病？
A. 心室中隔缺損合併心衰竭
B. 阻塞性肥厚心肌症合併心衰竭
C. 二尖瓣閉鎖不全合併心衰竭
D. 主動脈瓣狹窄合併心衰竭

正確答案：D. 主動脈瓣狹窄合併心衰竭